Clinical trial inclusion criterion:
6. No Congenital,Mental and other Nervous system diseases

Annotated entities:
- Condition: "Nervous system diseases"
- Negation: "No"
- Condition: "Congenital diseases"
- Condition: "Mental disease"